Clinical trial exclusion criterion:
Previous prescription of mineralocorticoid receptor antagonists, for cCSC or for other diseases;

Annotated entities:
- Temporal: "Previous"
- Drug: "mineralocorticoid receptor antagonists"
- Condition: "cCSC"
- Condition: "other diseases"